Clinical trial exclusion criterion:
Presence (i.e., above the ULN) of anti-thyroid stimulating hormone receptor antibodies (anti-TSHR) and anti-thyroid peroxidase antibody (anti-TPO)

Annotated entities:
- Value: "above the ULN"
- Value: "Presence"
- Measurement: "anti-thyroid stimulating hormone receptor antibodies (anti-TSHR)"
- Measurement: "anti-thyroid peroxidase antibody (anti-TPO)"